Major typhoid fever-associated complications

The above is a clinical trial exclusion criterion. Annotated with entity spans:
[Qualifier: Major] [Qualifier: typhoid fever-associated] [Condition: complications]